La primera etapa del mecanismo de deshidratación del ciclohexanol con H2SO4 es:
1. Pérdida de OH-.
2. Formación de un éster sulfato.
3. Protonación del alcohol.
4. Pérdida de H+ por parte del alcohol.
5. Eliminación de H2O a partir del alcohol.

Respuesta correcta: 3. Protonación del alcohol.